Clinical trial inclusion criterion:
Exercise-limiting claudication established by history and direct observation during a screening walking test administered by the evaluating vascular surgeon,

Annotated entities:
- Condition: "Exercise-limiting claudication"
- Temporal: "history"
- Procedure: "direct observation"
- Procedure: "screening walking test"